Clinical trial exclusion criterion:
Donation of blood or blood products within 8 weeks prior to vaccination or during the three week study period following

Entity relations:
- Has_index("within 8 weeks prior to vaccination", "vaccination")
- Has_index("during the three week study period", "the three week study period")
- Has_temporal("Donation of blood", "within 8 weeks prior to vaccination")
- OR("Donation of blood", "Donation of blood products")
- OR("within 8 weeks prior to vaccination", "during the three week study period")